Clinical trial exclusion criterion:
Subjects with inflammatory bowel disease, active colitis, or pre-existing intra-abdominal inflammation. Diverticulitis without active infection/inflammation will not be excluded.

Entity relations:
- Has_temporal("colitis", "active")
- Has_temporal("intra-abdominal inflammation", "pre-existing")
- Has_temporal("infection", "active")
- AND("Diverticulitis", "infection")
- Has_negation("infection", "without")
- Has_negation("Diverticulitis", "not be excluded")
- OR("inflammatory bowel disease", "colitis", "intra-abdominal inflammation")
- OR("infection", "inflammation")